Clinical trial exclusion criterion:
History of recurrent UTI (defined as three culture proven UTIs within last 12 months)

Entity relations:
- Has_multiplier("culture", "three")
- Has_temporal("recurrent UTI", "within last 12 months")
- AND("recurrent UTI", "culture")